新型隱球菌（Cryptococcus neoformans）型態上之特徵為何？
A. 無莢膜（without capsule）之兩型性（dimorphic）圓球狀酵母菌
B. 雪茄型酵母菌（cigar-shaped yeast），不具兩型性
C. 中裂型具有薄層莢膜兩型性（dimorphic）橢圓形酵母菌
D. 具寬厚莢膜圓球狀酵母菌

正確答案：D. 具寬厚莢膜圓球狀酵母菌